3. Temperature >38C on admission or fever during the preceding 48 hours

The above is a clinical trial inclusion criterion. Annotated with entity spans:
[Parsing_Error: 3.] [Measurement: Temperature] [Value: >38C] on admission or fever during the preceding 48 hours